11. Eltrombopag

The above is a clinical trial exclusion criterion. Annotated with entity spans:
[Parsing_Error: 11.] [Drug: Eltrombopag]